關於神經性厭食症（anorexia nervosa）之敘述，下列何者錯誤？
A. 拒絕維持體重，對變胖感到恐懼，無月經
B. 容易產生高血鉀與代謝性酸中毒
C. 致死率可高達 9%
D. 常跟不當催吐、過量使用軟便劑以及利尿劑有關

正確答案：B. 容易產生高血鉀與代謝性酸中毒